Clinical trial exclusion criterion:
Use of medications associated with steatosis eg. Methotrexate, anticonvulsants, antiretroviral therapy etc.

Entity relations:
- AND("medications", "steatosis")
- Subsumes("medications", "Methotrexate")
- OR("Methotrexate", "anticonvulsants", "antiretroviral therapy")